participant is willing to sign the study informed consent form

The above is a clinical trial inclusion criterion. Annotated with entity spans:
[Informed_consent: participant is willing to sign the study informed consent form]